Clinical trial inclusion criteria:
Is not of reproductive potential, or is of reproductive potential and agrees to avoid becoming pregnant or impregnating a partner while receiving trial medication or within 6 months after the last dose of trial medication
Has chronic back pain of =3 months duration by history
Has physician-diagnosed active nr-axSpA with disease duration <= 5 years
• Inflammatory back pain
• Arthritis (physician-diagnosed)
• Enthesitis (heel) physician-diagnosed (spontaneous pain or tenderness at examination of the site of the insertion of the Achilles tendon or plantar fascia)
• Dactylitis (physician-diagnosed)
• Psoriasis (physician-diagnosed)
• History of physician-diagnosed inflammatory bowel disease (IBD)
• History of uveitis confirmed by an ophthalmologist
• Good response to nonsteroidal anti-inflammatory drugs (NSAID)
• Family history of SpA (presence of ankylosing spondylitis, psoriasis, acute uveitis, reactive arthritis, or IBD)
• Elevated CRP
• Human leukocyte antigen B27 (HLA-B27)+ gene
Has a HLA-B27+ gene and 2 or more of the SpA characteristics listed above
Has elevated CRP at Screening or evidence of active inflammation in the sacroiliac joints on MRI
Has an ASDAS >= 2.1 at Screening
Shows high disease activity at Screening and Baseline of both a Total Back Pain score of =4 and a Bath Ankylosing Spondylitis Disease Activity Index (BASDAI) score of >= 4
Has an acceptable history of NSAID use
Has no history of untreated latent or active tuberculosis (TB) prior to Screening
Has had no recent close contact with a person with active TB or, if there has been such contact, will undergo additional evaluations and receive appropriate treatment for latent TB

Annotated entities:
- Pregnancy_considerations: "Is not of reproductive potential, or is of reproductive potential and agrees to avoid becoming pregnant or impregnating a partner while receiving trial medication or within 6 months after the last dose of trial medication"
- Condition: "chronic back pain"
- Qualifier: "=3 months duration"
- Temporal: "history"
- Measurement: "duration"
- Value: "=3 months"
- Condition: "nr-axSpA"
- Qualifier: "active"
- Measurement: "disease duration"
- Value: "<= 5 years"
- Qualifier: "disease duration <= 5 years"
- Condition: "Inflammatory back pain"
- Condition: "Arthritis"
- Condition: "Enthesitis"
- Qualifier: "heel"
- Condition: "pain"
- Condition: "tenderness"
- Qualifier: "site of the insertion of the Achilles tendon"
- Qualifier: "plantar fascia"
- Condition: "Dactylitis"
- Condition: "Psoriasis"
- Condition: "inflammatory bowel disease (IBD)"
- Temporal: "History"
- Condition: "uveitis"
- Non-representable: "confirmed by an ophthalmologist"
- Temporal: "History"
- Drug: "nonsteroidal anti-inflammatory drugs (NSAID)"
- Observation: "Good response"
- Observation: "Family history"
- Condition: "SpA"
- Condition: "ankylosing spondylitis"
- Condition: "psoriasis"
- Condition: "acute uveitis"
- Condition: "reactive arthritis"
- Condition: "IBD"
- Measurement: "CRP"
- Value: "Elevated"
- Condition: "gene Human leukocyte antigen B27"
- Condition: "(HLA-B27)+"
- Condition: "HLA-B27+"
- Condition: "SpA"
- Multiplier: "2 or more"
- Measurement: "CRP"
- Value: "elevated"
- Temporal: "at Screening"
- Qualifier: "active"
- Condition: "inflammation"
- Qualifier: "sacroiliac joints"
- Procedure: "MRI"
- Measurement: "ASDAS"
- Value: ">= 2.1"
- Temporal: "at Screening"
- Measurement: "Total Back Pain score"
- Value: "=4"
- Measurement: "Bath Ankylosing Spondylitis Disease Activity Index (BASDAI) score"
- Value: ">= 4"
- Condition: "high disease activity"
- Temporal: "at Screening and Baseline"
- Temporal: "history"
- Qualifier: "acceptable"
- Drug: "NSAID"
- Qualifier: "active"
- Qualifier: "untreated"
- Qualifier: "latent"
- Condition: "tuberculosis (TB)"
- Negation: "no"
- Temporal: "history"
- Temporal: "prior to Screening"
- Reference_point: "Screening"
- Observation: "close contact"
- Temporal: "recent"
- Observation: "person with active TB"
- Non-representable: "Has had no recent close contact with a person with active TB or, if there has been such contact, will undergo additional evaluations and receive appropriate treatment for latent TB"